Clinical trial exclusion criterion:
Severe Iron deficiency anemia (hemoglobin < 8.0 g/dL).

Annotated entities:
- Qualifier: "Severe"
- Condition: "Iron deficiency anemia"
- Measurement: "hemoglobin"
- Value: "< 8.0 g/dL"